Clinical trial exclusion criterion:
Coronary-artery bypass graft, percutaneous intervention (e.g. cardiac, cerebrovascular, aortic; diagnostic catheters are allowed) or major surgery, including thoracic and cardiac surgery, within the last 3 months.

Annotated entities:
- Procedure: "Coronary-artery bypass graft"
- Procedure: "percutaneous intervention"
- Procedure: "major surgery"
- Procedure: "cardiac surgery"
- Procedure: "thoracic surgery"
- Temporal: "within the last 3 months"
- Reference_point: "the last 3 months"